Clinical trial exclusion criterion:
2-hour C-peptide level < 1.8 ng/mL.

Entity relations:
- Has_value("2-hour C-peptide level", "< 1.8 ng/mL")